57 歲高血壓男性，洗澡時突發劇烈頭痛、嘔吐，至急診就醫。30 分鐘後，急診室醫師發現病人意識不清，但對疼痛刺激會張眼、並發出呻吟聲，也會用手指向痛點並撥開刺痛物，頸部僵硬。血壓 180/110 mmHg；耳溫 37.9°C；脈搏規則 80 次/分；呼吸 20 次/分。根據病史，最可能的診斷是：
A. 一氧化碳中毒（CO intoxication）
B. 蜘蛛膜下腔出血（subarachnoid hemorrhage）
C. 急性腦膜腦炎（acute meningoencephalitis）
D. 癲癇發作（epilepsy）

正確答案：B. 蜘蛛膜下腔出血（subarachnoid hemorrhage）